Patients with preeclampsia,

The above is a clinical trial exclusion criterion. Annotated with entity spans:
Patients with [Condition: preeclampsia],